List 3 enterotoxins produced by Clostridium difficile.

Toxin A (TcdA), toxin B (TcdB), and binary toxin (CDT) produced by Clostridium difficile (CD)